concomitant physical therapy

The above is a clinical trial exclusion criterion. Annotated with entity spans:
[Temporal: concomitant] [Procedure: physical therapy]